Clinical trial inclusion criterion:
Positive HBs Ag

Annotated entities:
- Measurement: "HBs Ag"
- Value: "Positive"